以下何者被視為造血幹細胞（hematopoietic stem cell）最重要的特徵？
A. 自我更新（self-renewal）
B. 增殖（proliferation）
C. 分化（differentiation）
D. 計畫凋亡（programmed death）

正確答案：A. 自我更新（self-renewal）